history of neurological disorders which might affect sensation such as previous stroke or peripheral neuropathy

The above is a clinical trial exclusion criterion. Annotated with entity spans:
history of [Condition: neurological disorders] which might [Condition: affect sensation] such as previous [Condition: stroke] or [Condition: peripheral neuropathy]